Affiliation to a social security system or similar,

The above is a clinical trial inclusion criterion. Annotated with entity spans:
[Observation: Affiliation to a social security system] or similar,